patients with Hb values < 11 g/dl and platelet values < 150,000/mmc.

The above is a clinical trial exclusion criterion. Annotated with entity spans:
patients with [Measurement: Hb] values [Value: < 11 g/dl] and [Measurement: platelet] values [Value: < 150,000/mmc].